Clinical trial exclusion criterion:
Gastrointestinal ulcer or tumor

Entity relations:
- OR("Gastrointestinal ulcer", "Gastrointestinal tumor")